Clinical trial exclusion criterion:
Systemic corticosteroids (oral or injectable) within 7 days of first dose of 852A (topical or inhaled steroids are allowed)

Annotated entities:
- Drug: "Systemic corticosteroids"
- Temporal: "within 7 days of first dose"
- Drug: "852A"
- Drug: "topical steroids"
- Drug: "inhaled steroids"
- Negation: "are allowed"
- Qualifier: "injectable"
- Qualifier: "oral"